Which is the target of belimumab in Systemic Lupus Erythematosus treatment?

Belimumab: a BLyS-specific inhibitor for systemic lupus erythematosus Belimumab, a fully human monoclonal antibody against B lymphocyte stimulator (BLyS), a B-cell survival factor, was licensed in 2011 for the treatment of autoantibody-positive SLE